Clinical trial exclusion criterion:
Evidence of systemic disease or neoplasia expected to compromise survival during 5-yr period

Annotated entities:
- Condition: "systemic disease"
- Condition: "neoplasia"
- Qualifier: "expected to compromise survival"
- Temporal: "during 5-yr period"